Clinical trial inclusion criterion:
Chronic pain syndrome

Annotated entities:
- Condition: "Chronic pain syndrome"